Clinical trial exclusion criterion:
Administration of long-acting immune-modifying drugs at any time during the study period

Entity relations:
- Has_index("at any time during the study period", "the study period")
- Has_temporal("immune-modifying drugs", "at any time during the study period")
- Has_qualifier("immune-modifying drugs", "long-acting")